Clinical trial inclusion criterion:
First single stroke ischaemic or haemorrhagic responsible of an hemiplegia

Annotated entities:
- Multiplier: "First"
- Multiplier: "single"
- Condition: "stroke"
- Qualifier: "ischaemic"
- Qualifier: "haemorrhagic"
- Condition: "hemiplegia"